List types of cancer where Long intergenic nonprotein coding RNA p53-induced transcript (LINC-PINT) is involved

Long intergenic nonprotein coding RNA p53-induced transcript (LINC-PINT) is involved in several types of cancer including pancreatic cancer, glioblastoma and breast cancer.